¿En qué infección está recomendado el tratamiento con vancomicina por vía oral?:
1. En infecciones por Klebsiella pneumoniae productora de carbapenemasa.
2. En colitis pseudomembranosa por Clostridium difficile.
3. En gastritis por Helicobacter pylori y siempre combinada con otros antimicrobianos.
4. En fiebre tifoidea que no responda a los tratamientos convencionales.

Respuesta correcta: 2. En colitis pseudomembranosa por Clostridium difficile.